第七顱神經所含之副交感神經節前纖維穿過何神經節，但不與該神經節內之神經元形成突觸？
A. 翼腭神經節（Pterygopalatine ganglion）
B. 下頜神經節（Submandibular ganglion）
C. 耳神經節（Otic ganglion）
D. 膝狀神經節（Geniculate ganglion）

正確答案：D. 膝狀神經節（Geniculate ganglion）